initial blast crisis CML

The above is a clinical trial exclusion criterion. Annotated with entity spans:
initial [Qualifier: blast crisis] [Condition: CML]